Clinical trial inclusion criterion:
3. ECOG Performance status ≤ 1

Annotated entities:
- Parsing_Error: "3."
- Measurement: "ECOG Performance status"
- Value: "≤ 1"